Clinical trial exclusion criterion:
Inability or unwillingness to comply with the treatment protocol, follow-up, or research tests.

Annotated entities:
- Condition: "Inability"
- Observation: "unwillingness"
- Informed_consent: "comply with the treatment protocol"
- Procedure: "follow-up"
- Post-eligibility: "research tests"